Clinical trial exclusion criterion:
Evidence or history of Cor Pulmonale

Annotated entities:
- Condition: "Cor Pulmonale"
- Mood: "Evidence"
- Temporal: "history"